Clinical trial inclusion criterion:
Having received standard HF therapy for at least 2 weeks, having reached target dose or max tolerable dose.

Annotated entities:
- Procedure: "standard HF therapy"
- Temporal: "for at least 2 weeks"
- Multiplier: "target dose"
- Multiplier: "max tolerable dose"